¿En qué momento del ciclo cardíaco se produce el máximo llenado de la circulación coronaria?:
1. Diástole ventricular.
2. Diástole auricular.
3. Sístole ventricular.
4. Tras la apertura de la válvula aórtica.

Respuesta correcta: 1. Diástole ventricular.